Respecto a la hipertrofia benigna de próstata NO es cierto que:
1. La ecografía abdominal es un método incruento para valorar el tamaño prostático y el residuo post-miccional.
2. Puede originar aumentos en los niveles de PSA.
3. El tacto rectal es un método para estimar el tamaño prostático.
4. El tratamiento con inhibidores de la 5-alfa reductasa disminuye los síntomas.
5. Es una lesión precancerosa.

Respuesta correcta: 5. Es una lesión precancerosa.